Clinical trial inclusion criterion:
Absence of dyspnea

Annotated entities:
- Condition: "dyspnea"
- Negation: "Absence of"